¿Cuál de las siguientes es la característica central de la etapa de las operaciones formales según Piaget?:
1. La solución de problemas de conservación.
2. La reversibilidad en el pensamiento.
3. La superación del egocentrismo.
4. La teoría de la mente.
5. El pensamiento hipotético-deductivo.

Respuesta correcta: 5. El pensamiento hipotético-deductivo.